5歲男孩2天前開始出現發燒、頭痛和喉嚨痛。發燒1天後頸部出現皮疹，接	散佈到軀幹和四肢。其紅色小丘疹感覺像砂紙一樣。病童口腔沒有潰瘍，舌頭呈草莓樣。此病最可能的致病原是：
A. 第6型人類疱疹病毒
B. 微小病毒B19型
C. 金黃色葡萄球菌
D. A型鏈球菌

正確答案：D. A型鏈球菌